Clinical trial exclusion criterion:
Diagnosis of asthma

Annotated entities:
- Condition: "asthma"